現在已知的肝炎病毒有五種，此類病毒很特殊，有 DNA 核，有 RNA 核，更有不完全核酸核，下列 那一項描述是錯誤的？
A. 肝炎病毒之 A、C、D 與 E 型之核酸均為 RNA，唯有 B 型為 DNA，且其一部分呈單鏈
B. D 型肝炎病毒平常不完全，且需 A 型之幫助來傳染並複製
C. 至目前所知，五種型的肝炎病毒中，B 型和 C 型可致慢性肝炎
D. 肝炎病毒 A 型和 E 型平常之傳染途徑為肛門（糞）至口

正確答案：B. D 型肝炎病毒平常不完全，且需 A 型之幫助來傳染並複製